Clinical trial exclusion criterion:
Doubtful compliance or unable to afford full course of therapy

Annotated entities:
- Observation: "Doubtful compliance"
- Observation: "unable to afford full course of therapy"